Clinical trial exclusion criterion:
Neoadjuvant chemotherapy for current malignancy

Annotated entities:
- Procedure: "Neoadjuvant chemotherapy"
- Condition: "malignancy"